When are itaconic acid levels elevated?

Itaconic acid levels are elevetad in immune defence.